下列有關Imipenem之敘述，何者錯誤？
A. 屬於β-lactamase抗性之抗菌劑
B. 抗菌範圍包括Gram positive和Gram negative菌和厭氣（Anaerobic）菌
C. 主要由腎臟排除，一般與Cilastatin合用
D. 藥效佳，可當第一線藥物來治療一般感染症

正確答案：D. 藥效佳，可當第一線藥物來治療一般感染症